下列有關呼吸道結構之敘述，何者錯誤？
A. 支氣管（bronchus）管壁具有軟骨片和環走平滑肌層
B. 細支氣管（bronchiole）內不具有軟骨片，主要由環走平滑肌層所構成
C. 終末細支氣管（terminal bronchiole）上皮具有多量杯狀細胞（goblet cells）
D. 終末細支氣管（terminal bronchiole）上皮的Clara cells 具有分泌蛋白質的功能，細胞表面不具纖毛

正確答案：C. 終末細支氣管（terminal bronchiole）上皮具有多量杯狀細胞（goblet cells）